Cuando se quieren analizar los componentes volátiles de una muestra líquida o sólida por cromatografía de gases, suele emplearse una metodología de espacio de cabeza (HS-GC). En su forma estática:
1. Se genera un aerosol sobre las muestras sólidas haciendo pasar un flujo de gas sobre la misma, lo que provoca la transferencia de compuestos volátiles al mismo. Después de un tiempo, un volumen de éste gas se introduce en la columna.
2. Sirve para analizar un líquido en contacto con un gas, por inyección de un pequeño volumen del líquido en la cabeza de la columna.
3. La muestra se coloca en un vial con un volumen de gas por encima, se cierra y se termostatiza. Una vez alcanzado el equilibrio entre las dos fases, una alícuota de gas se introduce en la corriente del gas portador que va a la columna.
4. La muestra en forma líquida se coloca en un vial y se cierra. Después de un tiempo, se abre el mismo para que se equilibren los componentes volátiles con los del entorno y posteriormente, se introduce un volumen del gas circundante al cromatógrafo.
5. Se realiza una extracción de la muestra liquida o sólida a un gas que fluye sobre la misma en forma continua.

Respuesta correcta: 3. La muestra se coloca en un vial con un volumen de gas por encima, se cierra y se termostatiza. Una vez alcanzado el equilibrio entre las dos fases, una alícuota de gas se introduce en la corriente del gas portador que va a la columna.